Subject or subject's legally acceptable representative has provided informed consent.

The above is a clinical trial inclusion criterion. Annotated with entity spans:
[Post-eligibility: Subject or subject's legally acceptable representative has provided informed consent.]